Clinical trial exclusion criterion:
The patient is currently using or has used cannabinoid based medications within 90 days of study entry and is unwilling to abstain for the duration of the study

Annotated entities:
- Drug: "cannabinoid based medications"
- Temporal: "within 90 days of study entry"